Clinical trial exclusion criterion:
Known cerebral/meningeal disease including signs or symptoms of progressive multifocal leukoencephalopathy (PML)

Entity relations:
- Subsumes("progressive multifocal leukoencephalopathy", "PML")
- Subsumes("cerebral disease", "progressive multifocal leukoencephalopathy")
- OR("cerebral disease", "meningeal disease")